Clinical trial inclusion criterion:
Over 18 years old.

Annotated entities:
- Value: "Over 18 years old"
- Person: "old"